What is another name for acid sphingomyelinase deficiency (ASMD)?

niemann-pick disease